Clinical trial exclusion criterion:
Use of prazosin or other alpha-1 antagonist (including but not limited to alfuzosin, doxazosin, silodosin, tamsulosin, terazosin) for any purpose in the 2 weeks prior to initial screen (P1) visit and prohibited throughout the study

Annotated entities:
- Drug: "prazosin"
- Qualifier: "other"
- Drug: "alpha-1 antagonist"
- Drug: "alfuzosin"
- Drug: "doxazosin"
- Drug: "silodosin"
- Drug: "tamsulosin"
- Drug: "terazosin"
- Temporal: "in the 2 weeks prior to initial screen (P1) visit"
- Reference_point: "initial screen (P1) visit"